Renal biopsy showing cellular or fibrocellular crescent in more than 25% of glomeruli.

The above is a clinical trial exclusion criterion. Annotated with entity spans:
[Procedure: Renal biopsy] showing [Condition: cellular] or [Condition: fibrocellular crescent] in [Multiplier: more than 25% of glomeruli].